下列有關單株丙型球蛋白病變（monoclonal gammopathy）之敘述，何者錯誤？
A. 常見於急性發炎之病人
B. 不一定會有Bence-Jones蛋白尿現象
C. 可能只含有免疫球蛋白之重鏈
D. 不一定會有漿細胞瘤或多發性骨髓瘤

正確答案：A. 常見於急性發炎之病人